Clinical trial inclusion criterion:
Ability to understand and the willingness to sign a written informed consent document written in English that is approved by an institutional review board.

Annotated entities:
- Non-query-able: "Ability to understand and the willingness to sign a written informed consent document written in English that is approved by an institutional review board."